Clinical trial exclusion criterion:
an underlying infectious disease

Entity relations:
- Has_qualifier("infectious disease", "underlying")